Male and female aged =19 and < 65 years.

The above is a clinical trial inclusion criterion. Annotated with entity spans:
[Person: Male] and [Person: female] [Person: aged] [Value: =19 and < 65 years].